對於夜尿量（nocturnal urinary volume）及夜間多尿症（nocturnal polyuria）的定義，下列何者正確？ ① 計算夜尿量應該包含睡前最後一次排尿量（the last void before going to bed） ②計算夜尿量應該包含早上起床第一次排尿量（the first void after rising in the morning） ③在65歲以上之婦女如果夜尿量大於24小時尿量的33%，則可定義為夜間多尿症 ④在65歲以上之婦女如果夜尿量大於24小時尿量的22%，則可定義為夜間多尿症
A. 僅①③
B. 僅②③
C. ①②③
D. ①②④

正確答案：B. 僅②③